Clinical trial exclusion criterion:
Preoperative chronic opiate use for chronic pain defined as opiate usage at least 60 mg/day of morphine equivalent for = 3 months (as defined by International Association for the Study of Pain22) in the one year period prior to the bariatric surgery

Annotated entities:
- Temporal: "Preoperative"
- Condition: "chronic pain"
- Drug: "opiate"
- Multiplier: "chronic"
- Drug: "opiate"
- Multiplier: "at least 60 mg/day of morphine equivalent"
- Multiplier: "for = 3 months"
- Temporal: "in the one year period prior to the bariatric surgery"
- Reference_point: "the bariatric surgery"
- Procedure: "bariatric surgery"